Clinical trial exclusion criterion:
obesity - BMI (body mass index) >30 kg/m2

Entity relations:
- Subsumes("BMI", "body mass index")
- Has_value("BMI", ">30 kg/m2")
- Subsumes("obesity", "BMI")